下列何種受體的訊息傳遞不是經由GTP-binding protein（G protein）？
A. muscarinic receptor
B. glucagon receptor
C. histamine receptor
D. NMDA receptor

正確答案：D. NMDA receptor